Diagnosis of type 1 diabetes mellitus (DM) or uncontrolled DM (patients on insulin therapy or with HbA1c > 9%)

The above is a clinical trial exclusion criterion. Annotated with entity spans:
Diagnosis of [Condition: type 1 diabetes mellitus (DM)] or [Qualifier: uncontrolled] [Condition: DM] (patients on [Procedure: insulin therapy] or with [Measurement: HbA1c] [Value: > 9%])